Clinical trial inclusion criterion:
dNMB with rocuronium during ear nose and throat (ENT) surgery

Annotated entities:
- Drug: "dNMB with rocuronium"
- Procedure: "ear nose and throat (ENT) surgery"